Clinical trial inclusion criterion:
De novo kidney transplants

Entity relations:
- Has_qualifier("kidney transplants", "De novo")